Clinical trial exclusion criterion:
Uncontrolled Diabetes (Hemoglobin A1C > 7.5)

Annotated entities:
- Qualifier: "Uncontrolled"
- Condition: "Diabetes"
- Measurement: "Hemoglobin A1C"
- Value: "> 7.5"